Clinical trial exclusion criterion:
Significant suicide or violence risk

Entity relations:
- Has_qualifier("suicide risk", "Significant")
- OR("suicide risk", "violence risk")